Clinical trial inclusion criterion:
With Child score B or C

Entity relations:
- Has_value("Child score", "B")
- OR("B", "C")